Clinical trial exclusion criterion:
Erythropoietin or IV iron in the previous 4 weeks

Entity relations:
- Subsumes("Erythropoietin", "in the previous 4 weeks")
- OR("Erythropoietin", "IV iron")